Pregnant or lactating females, or if sexually active and of childbearing potential, not using adequate methods of birth control.

The above is a clinical trial exclusion criterion. Annotated with entity spans:
[Pregnancy_considerations: Pregnant or lactating females, or if sexually active and of childbearing potential, not using adequate methods of birth control].